tryptophan

The above is a clinical trial exclusion criterion. Annotated with entity spans:
[Drug: tryptophan]